Clinical trial exclusion criterion:
Suspicion of secondary ITP

Annotated entities:
- Condition: "secondary ITP"